有關顳動脈血管炎（temporal arteritis）的敘述，下列何者正確？
A. 屬於中小型血管炎
B. 常常與風濕性多肌痛（polymyalgia rheumatica）一起發生
C. 好發於20～40歲女性
D. 通常對類固醇的治療反應不佳

正確答案：B. 常常與風濕性多肌痛（polymyalgia rheumatica）一起發生